下列那種狀況最可能立即增加受測者的心搏量（stroke volume）？
A. 提高心臟舒張末期容積
B. 提高動脈壓
C. 抑制交感神經
D. 以低強度刺激副交感神經

正確答案：A. 提高心臟舒張末期容積